Clinical trial exclusion criteria:
Inadequate bone marrow reserve
history of poorly controlled hypertension

Annotated entities:
- Condition: "Inadequate bone marrow reserve"
- Condition: "poorly controlled hypertension"
- Temporal: "history"